Clinical trial inclusion criterion:
The study patient provides informed consent and agrees to comply with all required post-procedure follow-up visits, including annual visits up to 5 years.

Annotated entities:
- Post-eligibility: "The study patient provides informed consent and agrees to comply with all required post-procedure follow-up visits, including annual visits up to 5 years."